Clinical trial inclusion criterion:
Male and female individuals between ages of 18 to 70 years old

Entity relations:
- Has_value("ages", "between 18 to 70 years old")